Clinical trial inclusion criterion:
Subjects must have failed at least two previous chemotherapy regimens. Paclitaxel must have been a component of one or both regimens and cisplatin or carboplatin must have been a component of one or both regimens.

Annotated entities:
- Multiplier: "at least two"
- Temporal: "previous"
- Procedure: "chemotherapy regimens"
- Observation: "failed"
- Drug: "Paclitaxel"
- Drug: "cisplatin"
- Drug: "carboplatin"